下列何者不是同源重組（homologous recombination）的生物功能？
A. 幫助染色體在減數分裂（meiosis）時的分離
B. 增加基因多樣性（genetic diversity）
C. 促進轉錄作用（transcription）
D. DNA 修復（DNA repair）

正確答案：C. 促進轉錄作用（transcription）